一位 53 歲女性，在一日中會有晝間起伏（Diurnal fluctuation）的近端肢體無力以及兩側眼皮下垂並複視，其最可能的病變是：
A. 肌肉病變（Myopathy）
B. 神經肌肉交界病變（Neuromuscular junction disorders）
C. 神經病變（Neuropathy）
D. 運動神經元疾病（Motor neuron disease）

正確答案：B. 神經肌肉交界病變（Neuromuscular junction disorders）